What does DMARD stand for?

DMARD stands for disease-modifying antirheumatic drug.